Clinical trial exclusion criterion:
Ongoing treatment with inotropic drugs (not norepinephrine)

Entity relations:
- Has_negation("norepinephrine", "not")
- AND("inotropic drugs", "norepinephrine")
- AND("treatment", "inotropic drugs")
- Has_temporal("treatment", "Ongoing")